Positive hepatitis C or hepatitis B surface antigen test and/or hepatits B core antibody test for immunoglobulin G (IgG) and/or immunoglobulin M (IgM).

The above is a clinical trial exclusion criterion. Annotated with entity spans:
[Value: Positive] [Measurement: hepatitis C] or [Measurement: hepatitis B surface antigen test] and/or [Measurement: hepatits B core antibody test] for [Qualifier: immunoglobulin G (IgG)] and/or [Qualifier: immunoglobulin M (IgM)].